Clinical trial exclusion criterion:
Having a remote infection,

Annotated entities:
- Condition: "remote infection"